Clinical trial inclusion criterion:
Demonstrate a positive cough stress test during complex multi-channel urodynamic testing

Annotated entities:
- Measurement: "cough stress test"
- Value: "positive"
- Procedure: "complex multi-channel urodynamic testing"